Clinical trial exclusion criterion:
Patients currently on chemotherapy or with other primary cancers requiring systemic or hepatic loco-regional treatment.

Annotated entities:
- Procedure: "chemotherapy"
- Temporal: "currently"
- Procedure: "hepatic loco-regional treatment"
- Procedure: "systemic loco-regional treatment"
- Condition: "primary cancers"
- Qualifier: "other"